Clinical trial inclusion criteria:
All patients admitted to the Duke CICU, who require intubation and sedation for mechanical ventilation that is expected to be >24 hours in duration will be included, unless they meet the specified exclusion criteria.
Patients intubated within one hour prior to care transition to the CICU will also be screened for inclusion.

Annotated entities:
- Visit: "Duke CICU"
- Procedure: "admitted"
- Procedure: "intubation"
- Procedure: "sedation"
- Procedure: "mechanical ventilation"
- Multiplier: ">24 hours in duration"
- Mood: "expected to be"
- Procedure: "intubated"
- Temporal: "within one hour prior to care transition"
- Procedure: "care transition"
- Reference_point: "care transition"